一位 40 歲已婚家庭主婦，近一個月持續出現情緒低落、沮喪、對生活失去信心、食慾減退、精力下降、入睡困難、早醒、有自殺意念，因而無法料理家事。你認為該患者最可能的診斷是：
A. 憂鬱症
B. 適應性疾患
C. 低落性情感疾患（dysthymic disorder）
D. 焦慮症

正確答案：A. 憂鬱症